Clinical trial inclusion criterion:
Ejection fraction = 50%, no severe arrhythmia.

Entity relations:
- Has_qualifier("arrhythmia", "severe")
- Has_negation("arrhythmia", "no")
- Has_value("Ejection fraction", "= 50%")
- OR("Ejection fraction", "arrhythmia")